降鈣素（calcitonin）主要是與何種荷爾蒙有生理拮抗（antagonist）作用？
A. 甲狀腺素（thyroxine）
B. 促濾泡素（FSH）
C. 雄性素（androgen）
D. 副甲狀腺素（PTH）

正確答案：D. 副甲狀腺素（PTH）